50歲女性因例行性子宮頸抹片結果異常，接受進一步子宮頸切片檢查，發現異生的細胞取代了整層原有的子宮上皮細胞，以原位雜交法（in situ hybridization）發現在這些異生的細胞有人類乳突病毒（human papillomavirus）第16型的DNA，則下列何者為最可能之診斷？
A. 尖形濕疣（condyloma acuminatum）
B. 慢性子宮頸炎併	狀細胞化生（chronic cervicitis with squamous metaplasia）
C. 子宮頸上皮內贅生第三級（cervical intraepithelial neoplasia III）
D. 子宮頸息肉（cervical polyp）

正確答案：C. 子宮頸上皮內贅生第三級（cervical intraepithelial neoplasia III）